Clinical trial exclusion criterion:
FEV1 >= 80% or FEV1 < 20% of predicted value post-bronchodilator.

Entity relations:
- Has_index("post-bronchodilator", "bronchodilator")
- Has_temporal("post-bronchodilator", "post-bronchodilator")
- AND("bronchodilator", "bronchodilator")
- Has_qualifier("FEV1", "post-bronchodilator")
- Has_value("FEV1", "< 20% of predicted value")
- Has_value("FEV1", ">= 80%")
- OR("FEV1", "FEV1")